Elderly patients over 65 years old exhibiting clinical indices of cardiovascular disease

The above is a clinical trial inclusion criterion. Annotated with entity spans:
[Person: Elderly] patients [Value: over 65 years] [Person: old] exhibiting [Undefined_semantics: clinical indices of cardiovascular disease]